With severe comorbidities, such as cardiovascular disease, chronic obstructive pulmonary disease, diabetes mellitus, and chronic renal dysfunction.

The above is a clinical trial exclusion criterion. Annotated with entity spans:
With [Qualifier: severe] [Condition: comorbidities], such as [Condition: cardiovascular disease], [Condition: chronic obstructive pulmonary disease], [Condition: diabetes mellitus], [Grammar_Error: and] [Condition: chronic renal dysfunction].